El primosoma:
1. También se denomina primasa o proteína Dna G.
2. Es el complejo responsable de la síntesis de los fragmentos de Okazaki.
3. Es una DNA ligasa bacteriana.
4. Se localiza en la mitocondria.
5. Es una unidad funcional del complejo de replicación bacteriano.

Respuesta correcta: 5. Es una unidad funcional del complejo de replicación bacteriano.